Previous ocular surgery history or ocular trauma that may confound the results of the study;

The above is a clinical trial exclusion criterion. Annotated with entity spans:
[Temporal: Previous] [Procedure: ocular surgery] history or [Condition: ocular trauma] that [Qualifier: may confound the results of the study];